Clinical trial exclusion criterion:
Allergy to study medications

Entity relations:
- AND("Allergy", "study medications")